Clinical trial inclusion criterion:
Alcohol misuse as defined by the Alcohol Use Disorders Identification Test (AUDIT) score subjects must score > 8 (associated with harmful or hazardous drinking)

Entity relations:
- Has_value("Alcohol Use Disorders Identification Test (AUDIT) score", "> 8")
- Subsumes("Alcohol misuse", "Alcohol Use Disorders Identification Test (AUDIT) score")